contact information is provided

The above is a clinical trial inclusion criterion. Annotated with entity spans:
[Post-eligibility: contact information is provided]